Clinical trial exclusion criterion:
Known creatinine clearance <30 mL/minute or on hemodialysis.

Entity relations:
- Has_value("creatinine clearance", "<30 mL/minute")
- OR("creatinine clearance", "hemodialysis")